Clinical trial exclusion criterion:
Malignant illness requiring systemic chemotherapy in the last 6 months

Entity relations:
- Has_temporal("systemic chemotherapy", "in the last 6 months")
- AND("Malignant illness", "systemic chemotherapy")